下列何者與大腦的運動皮層一起計畫和設計動作的進行程序（planning and programming movements）？
A. 小腦半球的內部（medial part）
B. 小腦半球的側部（lateral part）
C. 小腦蚓部（vermis）
D. 小腦小葉（flocculonodular lobe）

正確答案：B. 小腦半球的側部（lateral part）